Clinical trial exclusion criterion:
Another obvious severe disease explaining insomnia

Annotated entities:
- Condition: "severe disease"
- Condition: "insomnia"